下列有關成年人的遠端橈骨骨折（Colles 氏骨折）敘述，何者正確？
A. 最常好發於 40 歲以下
B. 女性的發生率比男性低
C. 很少發生骨折不癒合（non-union）
D. 遠端橈骨尺骨關節（radio-ulnar joint）不完全脫位很罕見

正確答案：C. 很少發生骨折不癒合（non-union）